Clinical trial exclusion criterion:
history of substance abuse or current excessive use of alcohol

Entity relations:
- Has_temporal("excessive use of alcohol", "current")
- Has_temporal("substance abuse", "history")
- OR("substance abuse", "excessive use of alcohol")